細菌內毒素（endotoxin）的產生來自：
A. 細菌代謝產物
B. 纖毛
C. 革蘭氏陽性菌細胞壁
D. 革蘭氏陰性菌細胞壁

正確答案：D. 革蘭氏陰性菌細胞壁